What is commotio cordis?

Commotio cordis is a term used to describe cases of blunt thoracic impact causing sudden death without structural damage of the heart